Which R/Bioconductor package has been developed for visualizing differential amino acid group usage in proteomics?

dagLogo is an R/Bioconductor package for identifying and visualizing differential amino acid group usage in data. dagLogo allows various formats for input sets and provides comprehensive options to build optimal background models.